一位滿 1 歲大的女孩被帶至門診作健康檢查，祖母擔心她的發展比較慢。下列何種狀況需轉介作進一步的發展評估？
A. 不會扶著嬰兒床欄杆站起來
B. 不會疊四塊積木
C. 問她身體部位，不會用手比
D. 不會說「不」

正確答案：A. 不會扶著嬰兒床欄杆站起來